Which cells mature in the human thymus?

Late stages of T cell maturation in the thymus involve NF-kB and tonic type I interferon signaling. NF-kB and tonic interferon signals are involved in the final maturation of thymocytes into naive T cells.